Clinical trial exclusion criterion:
Patients with untreated central nervous system disease. Patients with controlled treated CNS lesions who have undergone surgery or stereotactic radiosurgery and stable for 4 weeks are eligible.

Annotated entities:
- Condition: "central nervous system disease"
- Undefined_semantics: "central nervous system disease"
- Qualifier: "untreated"
- Condition: "CNS lesions"
- Procedure: "surgery"
- Procedure: "stereotactic radiosurgery"
- Temporal: "for 4 weeks"
- Qualifier: "stable"
- Qualifier: "controlled"
- Qualifier: "treated"